以下關於大腸直腸癌篩檢之敘述，何者正確？
A. 一旦診斷發炎性腸道疾病（inflammatory bowel disease），就要每1至3年施行一次大腸鏡
B. 一般危險性族群，每1至2年以免疫法糞便潛血檢查篩檢是一個篩檢的好方式
C. 一旦診斷有腺瘤性息肉並切除後，應每年追蹤大腸鏡
D. 有一等親大腸癌家族史者，應從50歲開始每5年做一次大腸鏡

正確答案：B. 一般危險性族群，每1至2年以免疫法糞便潛血檢查篩檢是一個篩檢的好方式